Clinical trial inclusion criterion:
All patients admitted at the Gynecological emergency Unit at Hospital de Clínicas de Porto Alegre scheduled for uterine evacuation with <12 weeks of gestation.

Annotated entities:
- Visit: "Gynecological emergency Unit at Hospital de Clínicas de Porto Alegre"
- Procedure: "uterine evacuation"
- Condition: "gestation"
- Multiplier: "<12 weeks"